Ability to read and respond to questions in French or English.

The above is a clinical trial inclusion criterion. Annotated with entity spans:
[Non-query-able: Ability to read and respond to questions in French or English.]